Los reactivos de Grignard atacan a los epóxidos para dar, tras la oportuna hidrólisis:
1. Ácidos carboxílicos.
2. Amidas cíclicas.
3. Cadenas alifáticas abiertas.
4. Alcoholes de cadena abierta.
5. Éteres cíclicos.

Respuesta correcta: 4. Alcoholes de cadena abierta.